Clinical trial inclusion criterion:
Body Mass Index (BMI) >21 kg/m^2 and <35 kg/m^2.

Annotated entities:
- Measurement: "Body Mass Index (BMI)"
- Value: ">21 kg/m^2 and <35 kg/m^2"